病人為51歲男性，一年前開始有忌妒妄想，認為教會中的長者在追求他的太太，並指使她要和病人離婚，因此病人非常的生氣，除了當眾與教會的長者發生衝突外，也會脅迫太太。病人離群索居，沒有工作，日常生活希望他太太儘量不要離開他的視線，也會到她工作的場所偷偷監視，同時每天撰寫	教會長者的「罪行」分送親友。病人除了忌妒妄想外，還有一些怪異的宗教幻想。由於其暴力傾向越來越明顯，他的太太非常害 怕回家，唯恐被病人殺害，因此求助於醫師。在此種情況下，下列處置何者最不適當？
A. 直接開立抗精神病藥滴劑給病人家屬，以便其讓病人服用
B. 強制病人住院接受治療
C. 提供家屬可以利用的社會資源及管道
D. 考慮到病人及家屬安全，通知相關社工或警政單位

正確答案：A. 直接開立抗精神病藥滴劑給病人家屬，以便其讓病人服用